Injuries to or operations on the central nervous system, eyes and ears within the last 2 months.

The above is a clinical trial exclusion criterion. Annotated with entity spans:
[Condition: Injuries] to or [Procedure: operations] on the [Qualifier: central nervous system], [Qualifier: eyes] and [Qualifier: ears] within the [Temporal: last 2 months].